Clinical trial inclusion criterion:
Multiple contiguous gingival recession defects on a minimum of two adjacent teeth, exhibiting 3mm or more recession on at least one of those teeth

Annotated entities:
- Condition: "gingival recession defects"
- Multiplier: "Multiple"
- Multiplier: "minimum of two"
- Value: "3mm or more"
- Measurement: "recession"
- Multiplier: "at least one"